下列何種狀況並不會明顯增加女性內因性尿道括約肌功能缺失（intrinsic sphincter deficiency）的危險？
A. 女性荷爾蒙缺乏
B. 骨盆腔放射線治療
C. 薦椎處副交感神經病變，但無合併其他交感神經病變
D. 陰部神經（pudendal nerve）受傷

正確答案：C. 薦椎處副交感神經病變，但無合併其他交感神經病變